Patients with thrombosis within the hepatic, portal, or mesenteric veins.

The above is a clinical trial exclusion criterion. Annotated with entity spans:
Patients with [Condition: thrombosis] within the [Qualifier: hepatic], [Qualifier: portal], or [Qualifier: mesenteric veins].